Clinical trial exclusion criterion:
Tricuspid valve stenosis, Supra-pulmonary valve stenosis

Entity relations:
- OR("Tricuspid valve stenosis", "Supra-pulmonary valve stenosis")